Children 7-17 with moderate to severe pain requiring around the clock treatment with an opioid analgesic.

The above is a clinical trial inclusion criterion. Annotated with entity spans:
[Person: Children] 7-17 with [Qualifier: moderate] to [Qualifier: severe] [Condition: pain] requiring [Procedure: around the clock treatment] with an [Drug: opioid analgesic].